Clinical trial inclusion criterion:
surgery less than 3 hours.

Entity relations:
- Has_temporal("surgery", "less than 3 hours")